Clinical trial exclusion criterion:
4. Noise-induced hearing loss or tinnitus.

Entity relations:
- OR("Noise-induced hearing loss", "tinnitus")